What disease does BCG immunotherapy used to treat?

Bacillus Calmette- Guérin (BCG) immunotherapy is used in the treatment of bladder cancer.